Clinical trial exclusion criterion:
Substance or alcohol abuse.

Entity relations:
- OR("Substance abuse", "alcohol abuse")